Children with clinical diagnosis of PWS;

The above is a clinical trial inclusion criterion. Annotated with entity spans:
[Person: Children] with [Qualifier: clinical diagnosis] of [Condition: PWS];